下列何者為腸繫膜下動脈的分支？
A. 肛門上動脈
B. 肛門中動脈
C. 肛門下動脈
D. 膀胱下動脈

正確答案：A. 肛門上動脈